Hip dysplasia (center edge angle < 20° on AP radiograph)

The above is a clinical trial exclusion criterion. Annotated with entity spans:
[Condition: Hip dysplasia] ([Measurement: center edge angle] [Value: < 20°] on [Procedure: AP radiograph])